Clinical trial exclusion criterion:
History of hypersensitivity or adverse reaction to bupivacaine or narcotics

Annotated entities:
- Condition: "hypersensitivity"
- Condition: "adverse reaction"
- Drug: "bupivacaine"
- Drug: "narcotics"